Clinical trial exclusion criterion:
3. Participated in any other research study within 60 days prior to screening

Annotated entities:
- Context_Error: "Participated in any other research study within 60 days prior to screening"